Clinical trial inclusion criterion:
8. Informed assent obtained and signed

Annotated entities:
- Post-eligibility: "Informed assent obtained and signed"
- Non-query-able: "Informed assent obtained and signed"